Clinical trial exclusion criterion:
Patients with hepatic failure defined as coagulopathy with elevated transaminases more than three times normal values

Annotated entities:
- Condition: "hepatic failure"
- Condition: "coagulopathy"
- Measurement: "transaminases"
- Value: "elevated more than three times normal values"